uncontrolled hypertension

The above is a clinical trial exclusion criterion. Annotated with entity spans:
[Qualifier: uncontrolled] [Condition: hypertension]